Clinical trial exclusion criterion:
Recanalized (TIMI I-III flow) IRA at coronary angiography.

Annotated entities:
- Procedure: "Recanalized"
- Condition: "IRA"
- Procedure: "coronary angiography"
- Qualifier: "TIMI I-III flow"